current alcohol abuse or drug dependence

The above is a clinical trial exclusion criterion. Annotated with entity spans:
[Temporal: current] [Condition: alcohol abuse] or [Condition: drug dependence]